Pregnant and breastfeeding women.

The above is a clinical trial exclusion criterion. Annotated with entity spans:
[Pregnancy_considerations: Pregnant and breastfeeding women].